Subject with hereditary degenerative retinal disorders such as retinitis pigmentosa

The above is a clinical trial exclusion criterion. Annotated with entity spans:
Subject with [Condition: hereditary degenerative retinal disorders] such as [Condition: retinitis pigmentosa]